Clinical trial inclusion criterion:
aged 20 years or greater

Entity relations:
- Has_value("aged", "20 years or greater")